9. No pain(including dysmenorrhea) or drug use (e.g., antipyretics,sleeping pills) within the last month

The above is a clinical trial inclusion criterion. Annotated with entity spans:
9. [Negation: No] [Condition: pain](including [Condition: dysmenorrhea]) or [Drug: drug] use (e.g., [Non-query-able: antipyretics],sleeping pills) within the [Temporal: last month]